Clinical trial exclusion criterion:
Patients with a known diagnosis of defective hemostasis and past history of clinical bleeding requiring transfusion and treatment;

Entity relations:
- Has_qualifier("hemostasis", "defective")
- AND("bleeding", "transfusion")
- AND("bleeding", "treatment")